Clinical trial exclusion criterion:
History of previous surgery on the same knee

Annotated entities:
- Procedure: "surgery"
- Qualifier: "knee"